Clinical trial inclusion criterion:
Subject is pregnant.

Annotated entities:
- Condition: "pregnant"